Los linfocitos Th1:
1. Activan a linfocitos B y eosinófilos.
2. Activan a macrófagos y linfocitos NK.
3. Secretan principalmente IL-4.
4. Promueven la producción de lgE.
5. Son un tipo de linfocitos Treg.

Respuesta correcta: 2. Activan a macrófagos y linfocitos NK.